Se mide la concentración de proteínas séricas en la muestra de un paciente que presenta un cuadro de inflamación aguda. Indique cuál de ellas se espera que se encuentre a concentraciones bajas:
1. Haptoglobina.
2. Proteína C reactiva.
3. Transferrina.
4. Alfa-1 –antitripsina.

Respuesta correcta: 3. Transferrina.